Clinical trial exclusion criterion:
6. Routine use (more than twice a week) of a chlorinated swimming pool.

Annotated entities:
- Parsing_Error: "6."
- Multiplier: "more than twice a week"
- Multiplier: "Routine use"
- Observation: "chlorinated swimming pool"
- Non-query-able: "chlorinated swimming pool"